有關疥瘡（scabies）的敘述，下列何者錯誤？
A. 第一次感染的潛伏期約 2～4 天
B. 大部分成年人感染疥瘡，其皮膚病變很少出現在臉上
C. 會讓患者晚上癢得無法睡覺
D. 可能傳染給家人

正確答案：A. 第一次感染的潛伏期約 2～4 天